Veteran receiving care within the Veterans Health Administration healthcare system

The above is a clinical trial inclusion criterion. Annotated with entity spans:
[Person: Veteran] receiving care within the [Visit: Veterans Health Administration healthcare system]